下列何者為胸部 X 光可見到異常的最小單位？
A. 原發性小葉（primary lobule）
B. \ 繼發性小葉（secondary lobule）
C. 腺泡（acinus）
D. 細支氣管（bronchiole）

正確答案：C. 腺泡（acinus）